考慮年齡及 international neuroblastoma staging system，下列那一種神經母細胞瘤（neuroblastoma）的預後最佳？
A. stage 3，4 歲
B. stage 4，5 歲
C. stage 4，2 歲
D. stage 4S，9 個月大

正確答案：D. stage 4S，9 個月大